有關肘關節駭人的傷害三合組（terrible triad injuries of the elbow），下列何者除外？
A. 鳥喙狀骨骨折（coronoid fracture）
B. 橈骨頭部骨折（radial head fracture）
C. 肱骨髁上骨折（supracondylar fracture of humerus）
D. 肘關節脫臼（elbow dislocation）

正確答案：C. 肱骨髁上骨折（supracondylar fracture of humerus）